How does ranolazine affect kinase signaling activation in the heart?

Ranolazine inhibits Ca(2+)/calmodulin kinase II (CaMKII) activity